下列皮膚及軟組織感染與致病菌的配對，何者錯誤？
A. gas gangrene：Clostridium perfringenes
B. bullous impetigo：Staphylococcus aureus
C. cat-scratch disease：Streptococcus pyogenes
D. Fournier's gangrene：mixed aerobic and anaerobic infection

正確答案：C. cat-scratch disease：Streptococcus pyogenes